有關乳癌發生在懷孕期間之敘述，何者正確？
A. 根據目前統計資料顯示懷孕時期發生之乳癌比非懷孕時期之預後為差
B. 乳房攝影檢查（Mammography）禁止使用在疑似乳癌之懷孕婦女
C. 細針穿吸法（Fine-needle aspiration）不適用於懷孕婦女
D. 懷孕時期發生之乳癌通常較不容易早期診斷出來

正確答案：D. 懷孕時期發生之乳癌通常較不容易早期診斷出來